1000 公克的早產兒，在新生兒加護病房的 1 個月治療中，發生了各種嚴重的併發症，包括：呼吸窘迫症、氣胸、肺炎、壞死性腸炎、敗血症及肺炎，現在更因為腦出血而出現呼吸暫停及缺氧，嬰兒將留下嚴重腦神經後遺症，家長經再三考慮後，要求醫師停止一切維持生命的治療，下列何者為最正確的處置？
A. 可以立即停止一切維生治療
B. 請家屬自己移除呼吸器
C. 可以停止升壓劑，但不能移除呼吸器
D. 請家屬簽 DNR，當情況惡化時，不施與急救

正確答案：D. 請家屬簽 DNR，當情況惡化時，不施與急救